Describe the application of whole genome sequencing in the diagnosis of primary ciliary dyskinesia (PCD)

Genetic testing is an important component of diagnosing PCD, especially in cases of atypical disease history. In these cases it may detect SVs and is a powerful tool for novel gene discovery. WGS is effective in cases where prior gene panel testing has found no variants or only heterozygous variants.